生產時，那些荷爾蒙可直接影響子宮肌肉收縮？
A. 皮質醇（cortisol）及甲狀腺素（thyroxine）
B. 甲狀腺素及攝護腺素（prostaglandin）
C. 攝護腺素與催產素（oxytocin）
D. 催產素與皮質醇

正確答案：C. 攝護腺素與催產素（oxytocin）